List orally bioavailable MPS1 kinase inhibitors

MPS1 kinase is a key regulator of the spindle assembly checkpoint (SAC), a mitotic mechanism specifically required for proper chromosomal alignment and segregation. It has been found aberrantly overexpressed in a wide range of human tumors and is necessary for tumoral cell proliferation. CCT251455, BOS172722, CCT271850, 4-(4-aminopyrazolo[1,5-a][1,3,5]triazin-8-yl)benzamides and NMS-P715 are orally bioavailable MPS1 kinase inhibitors.